Clinical trial inclusion criterion:
Onset of MS symptoms (as determined by a neurologist, either at present or retrospectively) within 10 years of the date the ICF is signed

Annotated entities:
- Condition: "MS symptoms"
- Temporal: "within 10 years"